王小明，25 歲，高中入學之體檢發現有B型肝炎帶原，之後有定期追蹤。目前肝功能AST 20 U/L，ALT 15 U/L，HBeAg陽性，HBV DNA值為 2×107 IU/mL。家族史方面，他的媽媽和哥哥也是B肝帶原者，有一位舅舅在 45 歲得到肝細胞癌。下列敘述何者錯誤？
A. 王小明感染 B 型肝炎之最可能途徑為垂直感染（Vertical transmission）
B. 王小明目前處於 B 型肝炎自然病史中之「免疫耐受期（Immune tolerance phase）」
C. 王小明未來發生肝癌之機率比一般 B 型肝炎帶原者為高
D. 王小明應開始接受抗病毒治療

正確答案：D. 王小明應開始接受抗病毒治療